Clinical trial exclusion criterion:
Any history of meningococcal vaccination or meningococcal and gonorrhoea diseases.

Entity relations:
- Has_temporal("meningococcal vaccination", "history")
- OR("meningococcal vaccination", "meningococcal diseases", "gonorrhoea diseases")